除影像學檢查外，臨床上常用那種侵入性方法來鑑別囊腫和實質性腫瘤？
A. 細針穿刺
B. 粗針切片
C. 麥瑪通乳房切片（mammatome）
D. 傳統切片手術

正確答案：A. 細針穿刺